Which is the master oncogenic transcription factor in T-cell acute lymphoblastic leukemia?

The oncogenic transcription factor TAL1/SCL induces an aberrant transcriptional program in T-Cell Acute lymphoblastic Leukemia (T-ALL) cells.